Clinical trial inclusion criterion:
Serum intact parathyroid hormone =600 pg/mL

Annotated entities:
- Measurement: "Serum intact parathyroid hormone"
- Value: "=600 pg/mL"